Clinical trial exclusion criterion:
oral steroids (topical and inhaled steroids are acceptable)

Entity relations:
- Has_negation("inhaled steroids", "acceptable")
- AND("oral steroids", "inhaled steroids")
- Has_negation("topical steroids", "acceptable")
- AND("oral steroids", "topical steroids")